Active proliferative diabetic retinopathy (PDR) in the study eye such as NVE, NVD, vitreous hemorrhage, or neovascular glaucoma.

The above is a clinical trial exclusion criterion. Annotated with entity spans:
[Condition: Active proliferative diabetic retinopathy (PDR)] [Qualifier: in the study eye] such as [Condition: NVE], [Condition: NVD], [Condition: vitreous hemorrhage], or [Condition: neovascular glaucoma].